Which personality disorder is treated using dialectical behavior therapy?

Dialectical behavior therapy is an evidence-based psychosocial treatment with efficacy in reducing self-harm behaviors in borderline personality disorder.